下列何種心律最不易導致暈厥？
A. sinus tachycardia
B. sinus bradycardia
C. atrioventricular block
D. ventricular tachycardia

正確答案：A. sinus tachycardia